Non-English speaking patients

The above is a clinical trial exclusion criterion. Annotated with entity spans:
[Non-query-able: Non-English speaking patients]